Clinical trial inclusion criterion:
Failed response to previous trial of two anti-epileptic drugs. In the case of infantile spasms this could include a trial of corticosteroids.

Entity relations:
- Has_multiplier("anti-epileptic drugs", "two")
- Has_qualifier("response", "Failed")
- AND("response", "anti-epileptic drugs")
- AND("anti-epileptic drugs", "corticosteroids")